if Hepatic disease is present

The above is a clinical trial exclusion criterion. Annotated with entity spans:
if [Condition: Hepatic disease] is present